allergy to morphine or ketamine

The above is a clinical trial exclusion criterion. Annotated with entity spans:
[Condition: allergy] to [Drug: morphine] or [Drug: ketamine]